Helicobacter pylori infection業已證實為消化性潰瘍的主因，關於此細菌的特性，下列敘述何者正確？
A. Helicobacter pylori infection會造成10～15%的感染者產生慢性胃炎，這些患者少數會發生消化性潰瘍或胃癌
B. Helicobacter pylori會分泌catalase，會產生NH3來中和胃酸，因此細菌得以於胃酸中存活
C. 不同strain的Helicobacter pylori可能帶有不同的毒性因子，如pathogenicity island（cag-PAI）會encode毒
D. Helicobacter pylori infection的outcome除了bacterial virulent factor之外，也與host factor有關，若兩者交互作用造成antrum-predominant胃炎，感染者的胃萎縮及胃癌的風險關聯性較大；若造成corpus-predominant 胃炎，感染者的十二指腸潰瘍的風險較大，而與胃癌的風險關聯性較小

正確答案：C. 不同strain的Helicobacter pylori可能帶有不同的毒性因子，如pathogenicity island（cag-PAI）會encode毒